Clinical trial inclusion criterion:
• Elevated CRP

Annotated entities:
- Measurement: "CRP"
- Value: "Elevated"